Clinical trial exclusion criterion:
Any condition that in the opinion of the investigator or the Novartis medical monitor would jeopardize the evaluation of efficacy or safety

Annotated entities:
- Condition: "condition"
- Non-representable: "in the opinion of the investigator"
- Non-representable: "in the opinion of the Novartis medical monitor"
- Qualifier: "that would jeopardize the evaluation of efficacy"
- Qualifier: "that would jeopardize safety"